signed informed consent before PCI.

The above is a clinical trial inclusion criterion. Annotated with entity spans:
[Informed_consent: signed informed consent before PCI].